2. Best corrected visual acuity (BCVA) at baseline <20/200.

The above is a clinical trial exclusion criterion. Annotated with entity spans:
[Parsing_Error: 2.] [Measurement: Best corrected visual acuity (BCVA)] [Temporal: at baseline] [Value: <20/200].